細胞在下列何種情況之下，會有反轉錄酵素（reverse transcriptase）活性的參與？
A. DNA lagging strand 的複製
B. DNA leading strand 的複製
C. 某些 RNA 病毒的複製
D. SV40 病毒的複製

正確答案：C. 某些 RNA 病毒的複製